Use of opioids or neuropathic analgesics

The above is a clinical trial exclusion criterion. Annotated with entity spans:
Use of [Drug: opioids] or [Drug: neuropathic analgesics]